Clinical trial exclusion criterion:
Treatment with MMF at >1.5 g/D for over 4 weeks within the past 3 months.

Annotated entities:
- Drug: "MMF"
- Multiplier: ">1.5 g/D for over 4 weeks"
- Temporal: "past 3 months"